Not sexually active with a male partner

The above is a clinical trial exclusion criterion. Annotated with entity spans:
[Negation: Not] [Observation: sexually active] with a [Qualifier: male partner]